Clinical trial exclusion criterion:
Patients whose medical condition does preclude the PLR manoeuvre

Annotated entities:
- Non-query-able: "Patients whose medical condition does preclude the PLR manoeuvre"